¿Qué aspecto relacionado con el estilo terapéutico NO adoptaría un terapeuta en la terapia Racional Emotiva Conductual?
1. Fomentar la catarsis.
2. Ser activo y directivo.
3. Ser verbalmente muy activo.
4. Ser didáctico.
5. Ser empático.

Respuesta correcta: 1. Fomentar la catarsis.